History of seizures

The above is a clinical trial exclusion criterion. Annotated with entity spans:
[Temporal: History of] [Condition: seizures]